Clinical trial inclusion criterion:
4. Healthy and self-reported sexually active

Entity relations:
- multi("self-reported", "self-reported")
- Has_qualifier("sexually active", "self-reported")